History of a severe seizure disorder or current anticonvulsant use.

The above is a clinical trial exclusion criterion. Annotated with entity spans:
History of a [Qualifier: severe] [Condition: seizure disorder] or [Temporal: current] [Drug: anticonvulsant] use.